¿Qué halógenos reaccionan con metano mediante una reacción radicalaria en cadena generando haloametanos?
1. Fluor y cloro.
2. Bromo y cloro.
3. Fluor, cloro y bromo.
4. Todos.
5. Yodo.

Respuesta correcta: 3. Fluor, cloro y bromo.